Clinical trial inclusion criterion:
Patients with rectal cancer stage: cT1-2-3, cN0-1, cM0.

Entity relations:
- Has_value("cM", "0")
- Has_value("cN", "0-1")
- Has_value("cT", "1-2-3")
- AND("stage", "cT")
- Has_qualifier("rectal cancer", "stage")
- OR("cT", "cN", "cM")